Clinical trial exclusion criterion:
chemotherapy for a malignancy within the previous 5 years

Annotated entities:
- Procedure: "chemotherapy"
- Condition: "malignancy"
- Temporal: "within the previous 5 years"